Clinical trial exclusion criterion:
acute hip fracture

Annotated entities:
- Condition: "hip fracture"
- Qualifier: "acute"